Subjects with a measured post-albuterol/salbutamol forced expiratory volume in 1 second (FEV1)/(forced vital capacity)FVC ratio of <=0.70 at Screening (Visit 1).

The above is a clinical trial inclusion criterion. Annotated with entity spans:
Subjects with a measured [Temporal: post-albuterol/salbutamol] [Measurement: forced expiratory volume in 1 second (FEV1)/(forced vital capacity)FVC ratio] of [Value: <=0.70] [Temporal: at Screening] (Visit 1).